Es propio de la acción del glucagón en el hígado la:
1. Activación de la glucógeno fosforilasa.
2. Activación de la glucolisis.
3. Activación de la glucógeno sintasa.
4. Inhibición de la proteína cinasa A.

Respuesta correcta: 1. Activación de la glucógeno fosforilasa.